What was the predominant rotavirus genotype in the pre-vaccine era, in Australia?

G1P[8] was the dominant genotype in Australia in the prevaccine era (1995-2006).